Clinical trial inclusion criteria:
Adequate performance status:
Breast - Karnofsky score > 50;
Ovarian, endometrial or cervical - Gynecologic Oncology Group (GOG) performance score ≤2
If female and of childbearing potential, are willing to use adequate contraception (hormonal, barrier method, abstinence) prior to study entry and for the duration of study participation.
Normal organ function within 14 days of study entry
Diagnosis of one of the following malignancies:
Metastatic breast cancer (BR)
Metastatic ovarian cancer (OV)
Metastatic endometrial cancer (EM)
Metastatic cervical cancer (CX)
Measurable metastatic disease (>1cm) in at least one site other than bone-only
Progression on or failure to respond to at least one previous chemotherapy regimen for metastatic disease
Progression on prior therapy with a hormonal agent if estrogen receptor or progesterone receptor positive, and/or with trastuzumab if HER2-neu positive. If patient has progressed through hormone or trastuzumab therapy only, must have received one chemotherapy regimen.
Measurable metastatic disease as defined by Response Evaluation Criteria in Solid Tumors (RECIST)
Primary tumor must have been diagnosed histologically as either epithelial ovarian cancer, fallopian tube cancer, or primary peritoneal cancer (not borderline or low malignant potential epithelial carcinoma).
Subjects must have failed at least two previous chemotherapy regimens. Paclitaxel must have been a component of one or both regimens and cisplatin or carboplatin must have been a component of one or both regimens.
Measurable metastatic disease
Histologically proven recurrent or persistent endometrial cancer that is not amenable to curative treatment with surgery and/or radiation therapy AND has failed 2 previous treatment regimens
Measurable metastatic disease
Histologically proven recurrent or persistent squamous cell carcinoma, adenosquamous carcinoma, or adenocarcinoma of the cervix that is not amenable to curative treatment with surgery and/or radiation therapy AND has failed 2 previous treatment regimens.

Annotated entities:
- Measurement: "performance status"
- Value: "Adequate"
- Non-representable: "Adequate performance status"
- Measurement: "Breast - Karnofsky score"
- Value: "> 50"
- Measurement: "Gynecologic Oncology Group (GOG) performance score"
- Value: "≤2"
- Qualifier: "Ovarian"
- Qualifier: "endometrial"
- Qualifier: "cervical"
- Person: "female"
- Condition: "childbearing potential"
- Observation: "willing to"
- Procedure: "contraception"
- Drug: "hormonal"
- Procedure: "barrier method"
- Procedure: "abstinence"
- Temporal: "for the duration of study participation"
- Temporal: "prior to study entry"
- Reference_point: "study entry"
- Reference_point: "study participation"
- Condition: "Normal organ function"
- Temporal: "within 14 days of study entry"
- Reference_point: "study entry"
- Condition: "Metastatic breast cancer"
- Condition: "Metastatic ovarian cancer"
- Condition: "Metastatic endometrial cancer"
- Condition: "Metastatic cervical cancer"
- Condition: "metastatic disease"
- Qualifier: "Measurable"
- Value: ">1cm"
- Value: "at least one"
- Qualifier: "site other than bone-only"
- Observation: "failure to respond"
- Observation: "Progression on"
- Temporal: "previous"
- Procedure: "chemotherapy regimen"
- Condition: "metastatic disease"
- Observation: "Progression on"
- Temporal: "prior"
- Procedure: "therapy with a hormonal agent"
- Condition: "estrogen receptor positive"
- Condition: "progesterone receptor positive"
- Condition: "HER2-neu positive"
- Procedure: "therapy with trastuzumab"
- Observation: "progressed through"
- Procedure: "hormone therapy"
- Procedure: "trastuzumab therapy"
- Procedure: "chemotherapy regimen"
- Measurement: "Response Evaluation Criteria in Solid Tumors (RECIST)"
- Condition: "metastatic disease"
- Condition: "epithelial ovarian cancer"
- Procedure: "histologically"
- Qualifier: "Primary tumor"
- Condition: "fallopian tube cancer"
- Condition: "primary peritoneal cancer"
- Qualifier: "borderline"
- Condition: "epithelial carcinoma"
- Negation: "not"
- Qualifier: "low malignant potential"
- Multiplier: "at least two"
- Temporal: "previous"
- Procedure: "chemotherapy regimens"
- Observation: "failed"
- Drug: "Paclitaxel"
- Drug: "cisplatin"
- Drug: "carboplatin"
- Condition: "metastatic disease"
- Qualifier: "Measurable"
- Measurement: "Histologically"
- Value: "proven"
- Qualifier: "amenable to curative treatment"
- Negation: "not"
- Procedure: "surgery"
- Procedure: "radiation therapy"
- Value: "2"
- Temporal: "previous"
- Procedure: "treatment regimens"
- Observation: "failed"
- Condition: "endometrial cancer"
- Qualifier: "persistent"
- Qualifier: "recurrent"
- Condition: "metastatic disease"
- Qualifier: "Measurable"
- Measurement: "Histologically"
- Value: "proven"
- Condition: "squamous cell carcinoma"
- Qualifier: "persistent"
- Qualifier: "recurrent"
- Condition: "adenosquamous carcinoma"
- Condition: "adenocarcinoma of the cervix"
- Qualifier: "amenable to curative treatment"
- Negation: "not"
- Procedure: "surgery"
- Procedure: "radiation therapy"
- Value: "2"
- Procedure: "treatment regimens"
- Temporal: "previous"